Comorbidities that can be associated with elevated natriuretic peptide (NP) levels: renal insufficiency, (eGFR < 25 ml/min/1.73 m² calculated according to MDRD formula), recent (less than 3 months) cerebral trauma or recent (less than 3 months) cerebrovascular incident, novel diagnosis or acute exacerbation of COPD within the last 3 months.

The above is a clinical trial exclusion criterion. Annotated with entity spans:
[Condition: Comorbidities] that can be associated with [Value: elevated] [Measurement: natriuretic peptide] ([Measurement: NP]) levels: [Condition: renal insufficiency], ([Measurement: eGFR] [Value: < 25 ml/min/1.73 m²] calculated according to MDRD formula), recent ([Temporal: less than 3 months]) [Condition: cerebral trauma] or recent ([Temporal: less than 3 months]) [Condition: cerebrovascular incident], novel diagnosis or [Condition: acute exacerbation of COPD] within the [Temporal: last 3 months].